Clinical trial exclusion criterion:
Glaucoma,

Annotated entities:
- Condition: "Glaucoma"